輸血治療是現代醫療上重要的突破。以往沒有方便的檢測方法時，常因血型的不相容而產生嚴重的輸血不良反應。下列何種紅血球捐血者和受血者的組合會產生不相容反應？
A. 捐血者：AB 型，受血者：A 型
B. 捐血者：O 型，受血者：B 型
C. 捐血者：B 型，受血者：AB 型
D. 捐血者：O 型，受血者：AB 型

正確答案：A. 捐血者：AB 型，受血者：A 型